Clinical trial inclusion criterion:
The presence of at least one lesion that can be accurately assessed at baseline by Computerised Tomography (CT), Magnetic Resonance Imaging (MRI) or plain X-ray and is suitable for repeated assessment

Annotated entities:
- Multiplier: "at least one"
- Condition: "lesion"
- Qualifier: "accurately assessed at baseline"
- Procedure: "Computerised Tomography (CT)"
- Procedure: "Magnetic Resonance Imaging (MRI)"
- Procedure: "plain X-ray"
- Qualifier: "suitable for repeated assessment"